在視覺神經傳導路徑中，最早產生動作電位（action potential）的細胞為何？
A. Bipolar cell
B. Ganglion cell
C. Horizontal cell
D. Photoreceptor cell

正確答案：B. Ganglion cell